Clinical trial exclusion criterion:
1. Patients with C class by child-pugh score

Entity relations:
- Has_value("child-pugh score", "C class")